Brain metastases that are untreated, symptomatic, or require therapy to control symptoms or any radiation, surgery, or other therapy to control symptoms from brain metastases within 2 months prior to randomization.

The above is a clinical trial exclusion criterion. Annotated with entity spans:
[Condition: Brain metastases] that are [Qualifier: untreated], [Qualifier: symptomatic], or [Qualifier: require therapy] to control symptoms or any [Procedure: radiation], [Procedure: surgery], or [Procedure: other therapy to control symptoms] from [Condition: brain metastases] [Temporal: within 2 months prior to randomization].